Clinical trial inclusion criterion:
Arterial occlusive disease per ankle Brachial index measurements and/or other imaging modalities,

Entity relations:
- AND("ankle Brachial index measurements", "Arterial occlusive disease")
- OR("ankle Brachial index measurements", "imaging modalities")